Clinical trial inclusion criterion:
No prior treatment with Ventavis or other active treatments for primary pulmonary hypertension within 6 weeks of date of study inclusion (unless otherwise advised by Bayer Schering Pharma)

Entity relations:
- AND("for primary pulmonary hypertension", "primary pulmonary hypertension")
- Has_qualifier("treatments", "for primary pulmonary hypertension")
- Has_negation("treatment with Ventavis", "No")
- Has_temporal("treatment with Ventavis", "within 6 weeks of date of study inclusion")
- OR("treatment with Ventavis", "treatments")